Clinical trial exclusion criterion:
Previous thoracic operation in the same side.

Entity relations:
- Has_qualifier("thoracic operation", "same side")
- Has_temporal("thoracic operation", "Previous")